Clinical trial exclusion criterion:
Antibiotics within 72 h

Entity relations:
- Has_temporal("Antibiotics", "within 72 h")